Las reacciones exergónicas del metabolismo:
1. Consumen energía libre.
2. Son termodinámicamente favorables.
3. Son siempre reacciones rápidas.
4. No requieren de la acción de enzimas.
5. Presentan valores elevados de energía de activación.

Respuesta correcta: 2. Son termodinámicamente favorables.